Señale cuál de las siguientes no es una decisión y acción de cuidado transcultural propuesto por Leininger:
1. Restructuración de los cuidados.
2. Supresión de los cuidados.
3. Negociación de los cuidados.
4. Mantenimiento de los cuidados.

Respuesta correcta: 2. Supresión de los cuidados.